Participation in any clinical studies within the last 4 weeks;

The above is a clinical trial exclusion criterion. Annotated with entity spans:
[Observation: Participation in any clinical studies] [Temporal: within the last 4 weeks];